Involvement of sclera at presentation

The above is a clinical trial exclusion criterion. Annotated with entity spans:
[Condition: Involvement of sclera] at presentation